Clinical trial exclusion criteria:
Newborns with severe congenital anomalies
Newborns with infection of the umbilical cord at birth

Annotated entities:
- Person: "Newborns"
- Condition: "severe congenital anomalies"
- Person: "Newborns"
- Condition: "infection of the umbilical cord"
- Temporal: "at birth"